De los siguientes inmunoensayos, el de mayor sensibilidad es:
1. Inmunofluerescencia.
2. Inmunoelectroforesis.
3. ELISA con quimioluminiscencia.
4. Nefelometría.

Respuesta correcta: 3. ELISA con quimioluminiscencia.